一位 60歲男性病人因急性心肌梗塞住院。一星期後，病人突然呼吸較喘，流冷 ；身體檢查顯示胸骨左側有新的心縮期雜音、血壓 65/50毫米汞柱（mmHg）、肺動脈壓 60/40毫米汞柱、中心靜脈壓（CVP）30毫米汞 柱，但意識清楚。下列敘述何者錯誤？①診斷為心室中隔破裂 ②不須裝置主動脈內氣球幫浦 ③須緊急手術，但若病人書面拒絕手術，則不可強行手術 ④若病人意識不清楚，也聯絡不到家屬，經初步治療略有改
 善，則不可立即手術
A. ①②③
B. 僅①③
C. ②④
D. 僅②

正確答案：D. 僅②